Una membrana rica en ácidos grasos insaturados:
1. Será más fluida que una membrana con ácidos grasos saturados.
2. Será más rígida cuanto mayor sea la temperatura a la que se encuentre dicha membrana.
3. Será más rígida que una membrana con ácidos grasos saturados.
4. La naturaleza de los ácidos grasos no interviene en la fluidez de las membranas.

Respuesta correcta: 1. Será más fluida que una membrana con ácidos grasos saturados.